La inhibina:
1. Inhibe la secreción de FSH.
2. Bloquea la secreción de estrógenos.
3. Estimula la secreción de GnRH.
4. La produce la adenohipófisis.
5. Estimula la secreción de LH.

Respuesta correcta: 1. Inhibe la secreción de FSH.